Clinical trial inclusion criterion:
Referred for surgery for open reduction and internal fixation for ankle fracture

Annotated entities:
- Procedure: "surgery"
- Procedure: "open reduction and internal fixation"
- Condition: "ankle fracture"